鼻竇感染最常經由下列那一靜脈擴散引起海綿竇栓塞（cavernous thrombosis）？
A. 角靜脈（angular vein）
B. 後顏面靜脈（posterior facial vein）
C. 乙狀竇（sigmoid sinus）
D. 淺顳靜脈（superficial temporal vein）

正確答案：A. 角靜脈（angular vein）